Clinical trial exclusion criterion:
Inability to communicate or cooperate with the investigators

Annotated entities:
- Post-eligibility: "Inability to communicate or cooperate with the investigators"